If Heart disease is present

The above is a clinical trial exclusion criterion. Annotated with entity spans:
If [Condition: Heart disease] is present